Clinical trial inclusion criterion:
Serum ferritin =500 ng/mL and transferrin saturation (TSAT) =25%

Entity relations:
- Subsumes("transferrin saturation", "TSAT")
- Has_value("transferrin saturation", "=25%")
- Has_value("Serum ferritin", "=500 ng/mL")
- OR("Serum ferritin", "transferrin saturation")